39 歲女性罹患縱膈 Hodgkin 氏病，發生一連串神經學障礙，腦脊髓液正常，核磁共振造影發現有髓鞘脫失（demyelination）區域，之後漸漸變為昏迷，發病後四個月死亡。她腦部的變化是：
A. 進行性多灶性白質腦病（progressive multifocal leukoencephalopathy）
B. 麴菌病（aspergillosis）
C. Hodgkin 氏病轉移
D. 腦梗塞（cerebral infarction）

正確答案：A. 進行性多灶性白質腦病（progressive multifocal leukoencephalopathy）